一位59歲接受腹膜透析腎病患者，血壓為125/80 mmHg，心跳為76次/min，12導程心電圖發現有peaked T waves，血鉀值為7.0 mmol/L，無溶血。下列何種處置最不優先？
A. 會診腎臟科後，等待做腹膜透析
B. 可使用葡萄糖（glucose）加胰島素（insulin）治療
C. 可使用碳酸氫鈉（sodium bicarbonate）治療
D. 可使用噴霧式支氣管擴張藥物（neubulized albuterol）治療

正確答案：A. 會診腎臟科後，等待做腹膜透析